Clinical trial exclusion criterion:
Vaccination less than 6 weeks prior to treatment with Lemtrada.

Entity relations:
- AND("treatment", "Lemtrada")
- multi("treatment with Lemtrada", "treatment")
- Has_index("less than 6 weeks prior to treatment with Lemtrada", "treatment with Lemtrada")
- AND("less than 6 weeks prior to treatment with Lemtrada", "Vaccination")